Treatment with oral contraceptives (unless a second form of birth control is used and documented)

The above is a clinical trial exclusion criterion. Annotated with entity spans:
[Procedure: Treatment] with [Drug: oral contraceptives] ([Negation: unless] a [Qualifier: second form] of [Observation: birth control] is used and documented)